Clinical trial exclusion criterion:
atrial fibrillation/flutter with a mean ventricular response rate at rest >100 beats per minute

Entity relations:
- Has_qualifier("mean ventricular response rate", "at rest")
- Has_value("mean ventricular response rate", ">100 beats per minute")
- AND("atrial fibrillation", "mean ventricular response rate")
- OR("atrial fibrillation", "atrial flutter")